一位 2 歲男童發燒 2 天後就診，發現有兩側急性中耳炎，給予 amoxicillin 40 mg/kg/day 治療 3 天之後，仍然持續發燒，於是改用 amoxicillin 90 mg/kg/day，體溫隨即回復正常。下列四種細菌之中，那一種最符合該男童中耳炎的治療反應？
A. Staphylococcus aureus
B. Streptococcus pneumoniae
C. Haemophilus influenzae
D. Moraxella catarrhalis

正確答案：B. Streptococcus pneumoniae